Clinical trial inclusion criterion:
Acceptance of home visitors

Annotated entities:
- Post-eligibility: "Acceptance of home visitors"